Clinical trial inclusion criterion:
Body mass index (BMI) from 18 to 35kg/m2

Annotated entities:
- Measurement: "Body mass index"
- Measurement: "BMI"
- Value: "from 18 to 35kg/m2"